Patients with a lesion > 0.5 cm in largest diameter size, initially scored BI-RADS® 3, 4a, 4b or 4c in B-mode ultrasound

The above is a clinical trial inclusion criterion. Annotated with entity spans:
Patients with a [Condition: lesion] [Value: > 0.5 cm] in [Measurement: largest diameter size], initially scored [Measurement: BI-RADS®] [Value: 3, 4a, 4b or 4c] in [Procedure: B-mode ultrasound]